Not planning to change use of medications known to influence appetite or metabolism

The above is a clinical trial inclusion criterion. Annotated with entity spans:
[Negation: Not] [Mood: planning to change] use of [Drug: medications known to influence appetite] or metabolism